Name an lncRNA associated with dilated cardiomyopathy.

The lncRNA H19 is significantly upregulated in the myocardial tissue in dilated cardiomyopathy.